Clinical trial inclusion criterion:
BMI 20 - 35 kg/m2

Entity relations:
- Has_value("BMI", "20 - 35 kg/m2")